Clinical trial exclusion criterion:
Pregnancy or nursing

Annotated entities:
- Condition: "Pregnancy"
- Condition: "nursing"